El fármaco antiulceroso denominado omeprazol presenta en su estructura:
1. Un heterociclo bencimidazólico.
2. Un grupo tiol.
3. Un heterociclo pirazólico.
4. Un grupo dimetilamino.
5. Un heterociclo tiozólico.

Respuesta correcta: 1. Un heterociclo bencimidazólico.